surgery less than 3 hours.

The above is a clinical trial inclusion criterion. Annotated with entity spans:
[Measurement: surgery] [Temporal: less than 3 hours].